一位 70 歲女性糖尿病患，自訴兩側乳房下有鮮紅斑（patches），四周環繞較小的衛星病灶（satellite lesions），KOH 鏡檢下看到許多酵母菌狀微生物（yeast-like organism）。其最可能的診斷為：
A. 念珠菌感染
B. 皮癬菌感染
C. 金黃色葡萄球菌感染
D. 帶狀疱疹

正確答案：A. 念珠菌感染